Women who are pregnant (as evidenced by pregnancy test if pre-menopausal)

The above is a clinical trial exclusion criterion. Annotated with entity spans:
[Person: Women] who are [Condition: pregnant] (as evidenced by [Procedure: pregnancy test] if [Condition: pre-menopausal])